下列那一類細胞的訊息受器（receptor）及其結合蛋白不具有酵素催化活性？
A. nuclear receptors
B. receptor protein kinases
C. G protein-coupled receptors
D. chemokine/cytokine receptors

正確答案：A. nuclear receptors